Clinical trial exclusion criterion:
Prisoners

Annotated entities:
- Person: "Prisoners"
- Non-query-able: "Prisoners"